Clinical trial exclusion criterion:
The use of beta blockers within 2 months of randomization

Annotated entities:
- Drug: "beta blockers"
- Temporal: "within 2 months of randomization"
- Reference_point: "randomization"